Clinical trial inclusion criteria:
Symptomatic primary knee osteoarthritis with failed conservative treatment at least 3 months
Kellgren-Lawrence grade I-III
Gave informed consent
Can do questionnaires

Annotated entities:
- Qualifier: "Symptomatic"
- Qualifier: "primary"
- Qualifier: "knee"
- Condition: "osteoarthritis"
- Procedure: "conservative treatment"
- Qualifier: "failed"
- Temporal: "at least 3 months"
- Measurement: "Kellgren-Lawrence grade"
- Value: "I-III"
- Informed_consent: "Gave informed consent"
- Observation: "Can do questionnaires"